History of ischemic heart disease or peripheral arterial disease or cerebrovascular disease

The above is a clinical trial exclusion criterion. Annotated with entity spans:
History of [Condition: ischemic heart disease] or [Condition: peripheral arterial disease] or [Condition: cerebrovascular disease]